下列何種疾病最不常合併有accessory pathway，也較少引致心室上心搏過速（supraventricular tachycardia）？
A. 愛伯斯坦氏異常（Ebstein anomaly）
B. 兩側右心房症（right atrial isomerism）
C. 法洛氏四重症（tetrology of Fallot）
D. Wolff-Parkinson-White 症候群（WPW syndrome）

正確答案：C. 法洛氏四重症（tetrology of Fallot）